Clinical trial exclusion criterion:
Subject has a life expectancy of = 1 year.

Entity relations:
- Has_value("life expectancy", "= 1 year")